Clinical trial exclusion criterion:
Unable to read/understand English

Annotated entities:
- Non-query-able: "Unable to read/understand English"